Psychiatric disease

The above is a clinical trial exclusion criterion. Annotated with entity spans:
[Condition: Psychiatric disease]